Clinical trial inclusion criterion:
clinical or pathological diagnosis of hepatocellular carcinoma (HCC) in previously untreated patients;

Annotated entities:
- Condition: "hepatocellular carcinoma"
- Qualifier: "clinical or pathological diagnosis"
- Condition: "HCC"
- Qualifier: "untreated"